Patient capable of understanding information about the study and of giving his/her consent

The above is a clinical trial inclusion criterion. Annotated with entity spans:
[Post-eligibility: Patient capable of understanding information about the study and of giving his/her consent]